Lipids: one group with an LDL =/>130 and Triglycerides < 150 mg/dL The 2nd group will have and LDL=/>130 mg/dL and Triglycerides =/>150 mg/dL but less than 400 mg/dL.

The above is a clinical trial inclusion criterion. Annotated with entity spans:
Lipids: [Non-representable: one group with] an [Measurement: LDL] [Value: =/>130] and [Measurement: Triglycerides] [Value: < 150 mg/dL] [Non-representable: The 2nd group will have and LDL=/>130 mg/dL and Triglycerides =/>150 mg/dL but less than 400 mg/dL.]